Clinical trial exclusion criterion:
Preoperative left ventricular ejection fraction < 30%, sick sinus syndrome, severe sinus bradycardia (< 50 beats per minute), or second-degree or above atrioventricular block without pacemaker;

Annotated entities:
- Measurement: "left ventricular ejection fraction"
- Value: "< 30%"
- Temporal: "Preoperative"
- Condition: "sick sinus syndrome"
- Qualifier: "severe"
- Condition: "sinus bradycardia"
- Value: "< 50 beats per minute"
- Condition: "atrioventricular block"
- Negation: "without"
- Device: "pacemaker"
- Qualifier: "second-degree or above"